理學檢查結果顯示腹部有壓痛，肛門指診有血絲，白血球數目上升，下列何者是最須優先考量之檢查項目？
A. 膀胱鏡檢查有無尿道損傷
B. 大腸鏡檢查有無腸道損傷
C. 傷口注射顯影劑攝影檢查有無瘻管（fistula）
D. 胸腹部 X 光檢查看腹腔內有無異常氣體（free air）

正確答案：D. 胸腹部 X 光檢查看腹腔內有無異常氣體（free air）